下列何者為手術後發燒（febrile morbidity）的定義？
A. 術後24小時後，有任2次至少間隔4小時的體溫高於38℃
B. 術後24小時後，有任2次至少間隔4小時的體溫高於39.5℃
C. 術後24小時內，體溫有1次高於38.3℃
D. 術後24小時內，體溫有1次高於39.5℃

正確答案：A. 術後24小時後，有任2次至少間隔4小時的體溫高於38℃